Male and females between ages 18-85 years of age

The above is a clinical trial inclusion criterion. Annotated with entity spans:
Ma[Person: l]e and [Person: females] [Value: between] [Person: ages] 18-85 years of age